下列何者與多囊性卵巢徵候群（polycystic ovarian syndrome）的診斷最無關？
A. 肥胖
B. 血液測得男性激素（androgen）增加
C. 臨床上有男性激素過高的表現（hyperandrogenism）
D. 規則之月經週期

正確答案：D. 規則之月經週期